Clinical trial exclusion criterion:
5. Are unable to walk.

Annotated entities:
- Condition: "unable to walk"